Clinical trial exclusion criterion:
Patients with allergies to narcotics or local anesthetic; or anticoagulant use (e.g. warfarin, dabigatran, rivaroxaban).

Annotated entities:
- Condition: "allergies"
- Drug: "narcotics"
- Drug: "local anesthetic"
- Drug: "anticoagulant"
- Drug: "warfarin"
- Drug: "dabigatran"
- Drug: "rivaroxaban"